Un grupo de investigadores realizó un estudio prospectivo para evaluar la eficacia de tres alternativas en el tratamiento de la otorrea aguda en niños con tubo de timpanostomía. De forma aleatorizada, 76 niños recibieron amoxicilina-ácido clavulánico oral, 77 recibieron gotas óticas con hidrocortisona-bacitracinacolistina y otros 77 niños no recibieron tratamiento    farmacológico     alguno,      sólo observación. La variable principal fue la presencia de otorrea. ¿De qué tipo de estudio se trata?
1. Estudio de cohortes.
2. Estudio postautorización de seguimiento prospectivo.
3. Estudio postautorización ligado a la autorización.
4. Ensayo clínico.
5. Estudio transversal.

Respuesta correcta: 4. Ensayo clínico.